Clinical trial inclusion criterion:
planned eye surgery under sedation

Annotated entities:
- Mood: "planned"
- Procedure: "eye surgery"
- Qualifier: "under sedation"
- Procedure: "sedation"